Clinical trial inclusion criterion:
T1DM for at least 12 months

Annotated entities:
- Condition: "T1DM"
- Temporal: "for at least 12 months"